下列何種蛋白質與G蛋白（G protein）的訊息傳遞路徑無關？
A. 類固醇受體（steroid receptors）
B. 腺苷酸環化酶（adenylyl cyclase）
C. 磷脂酶C（phospholipase C）
D. Ras蛋白

正確答案：A. 類固醇受體（steroid receptors）